La metilación de las bases de DNA:
1. Facilita la unión de los factores de transcripción al DNA.
2. Inactiva al DNA para la transcripción.
3. Evita que la cromatina se desenrolle.
4. Se lleva a cabo por las proteínas de mantenimiento del minicromosoma (MCM).

Respuesta correcta: 2. Inactiva al DNA para la transcripción.